Clinical trial exclusion criterion:
Contraindications to dapagliflozin according to the local label.

Entity relations:
- AND("Contraindications", "dapagliflozin")